與 Meningococcal meningitis 密切接觸而沒有適當防護的醫療人員，應接受暴露後抗菌藥物預防，建議的藥物是：
A. 口服 penicillin
B. 口服第一代 cephalosporin
C. 口服 rifampin
D. 局部 mupirocin

正確答案：C. 口服 rifampin